下列有關脂漏性皮膚炎 (seborrheic dermatitis) 之敘述，何者最不適當？
A. 臨床上常呈現油膩樣或脫屑性的紅斑
B. 不會發生於嬰兒（infant）
C. 和皮屑芽胞菌（Malassezia furfur）有關
D. 常位於皮脂腺（sebaceous gland）發達處

正確答案：B. 不會發生於嬰兒（infant）